Which is the function of the PRDM9 protein in mammals?

Here, we demonstrate that a major player for hotspot specification is the Prdm9 gene. In many organisms, recombination occurs at limited sites, termed 'hotspots', whose positions in mammals are determined by  PR domain member 9 ( PRDM9). In mammals, genetic recombination during meiosis is limited to a set of 1- to 2-kb regions termed hotspots. Developmental progress of germ cells through meiotic phases is closely tied to ongoing meiotic recombination.